一位 20 歲男性最近出現下肢水腫、小便有沖不掉的泡泡。抽血檢驗發現病人血中白蛋白數值偏低（albumin 2.0 g/dL）；而且尿液常規檢查發現病人有蛋白尿（urine protein > 300 mg/dL）。抽血檢驗 發現其血色素值有升高現象（hemoglobin 16.8 g/dL）。有關病人之敘述，下列何者最可能發生？
A. 病人腎臟的鈉總排出量會增加
B. 病人血中之腎素（renin）濃度會上升
C. 病人細胞外組織間質液（interstitial fluid）的淨水壓（hydrostatic pressure）會下降
D. 病人胸管內的淋巴流量（thoracic duct lymph flow）會減少

正確答案：B. 病人血中之腎素（renin）濃度會上升